Clinical trial inclusion criterion:
Based on single or averaged corrected QT interval (QTc) values of triplicate electrocardiograms obtained over a brief recording period: QTcF < 450 msec

Annotated entities:
- Measurement: "QTcF"
- Value: "< 450 msec"
- Qualifier: "single"
- Qualifier: "averaged"
- Measurement: "corrected QT interval (QTc)"
- Procedure: "electrocardiograms"
- Temporal: "over a brief recording period"